Clinical trial exclusion criterion:
14. Unprotected left main coronary artery disease (stenosis greater than 50%).

Annotated entities:
- Condition: "left main coronary artery disease"
- Qualifier: "Unprotected"
- Measurement: "stenosis"
- Condition: "stenosis"
- Value: "greater than 50%"